Son fragmentos del citoplasma de una célula precursora:
1. Linfocitos.
2. Megacariocitos.
3. Monocitos.
4. Plaquetas.
5. Eritrocitos.

Respuesta correcta: 4. Plaquetas.